Contra-indications to non-steroidal anti-inflammatory drugs: 1) history of hypersensitivity to NSAIDs or aspirin 2) active or history of peptic ulcer disease, chronic dyspepsia, or active or history of gastrointestinal bleed 3) Severe heart failure (NYHA 2 or worse) 4) hypertension (JNC7 stage 2 or worse) 5) Chronic kidney disease 3 or worse 6) Current use of anti-coagulants 7) Hepatitis 8) Alcoholism

The above is a clinical trial exclusion criterion. Annotated with entity spans:
[Condition: Contra-indications] to [Drug: non-steroidal anti-inflammatory drugs]: 1) [Temporal: history] of [Condition: hypersensitivity] to [Drug: NSAIDs] or [Drug: aspirin] 2) [Temporal: active] or [Temporal: history] of [Condition: peptic ulcer disease], [Condition: chronic dyspepsia], or [Temporal: active] or [Temporal: history] of [Condition: gastrointestinal bleed] 3) [Qualifier: Severe] [Condition: heart failure] ([Measurement: NYHA] [Value: 2 or worse]) 4) [Condition: hypertension] ([Measurement: JNC7 stage] [Value: 2 or worse]) 5) [Condition: Chronic kidney disease] 3 or worse 6) [Temporal: Current] use of [Drug: anti-coagulants] 7) [Condition: Hepatitis] 8) [Condition: Alcoholism]